Clinical trial exclusion criterion:
Pulmonary nodule requiring surgery

Annotated entities:
- Procedure: "surgery"
- Condition: "Pulmonary nodule"